Computational tools for predicting allosteric pathways in proteins

CorrSite identifies potential allosteric ligand-binding sites based on motion correlation analyses between cavities.